一位70歲男性病人，有糖尿病及高血壓病史，目前服用口服降血糖藥物治療，飯前血糖156 mg/dL，發生右側中等量肋膜積液約1000 c.c.，有3個月之久，肋膜積液檢查，蛋白為2.5 g/dL，LDH：150 U/L；L：N = 60：40，血清蛋白為6.0 g/dL，LDH為350 U/L，BUN：20 mg/dL，病人無蛋白尿，肝功能正常，左心室ejection fraction（EF）為45%，則病人肋膜積液之最可原因為：
A. 結核性肋膜炎
B. 左心衰竭
C. 右心衰竭
D. 自體免疫性肋膜炎

正確答案：B. 左心衰竭